¿Qué papel juega el TFIIH (factor de transcripción para la ARN polimerasa II, tipo H) en la activación de la transcripción eucariotica?:
1. La unión a la caja TATA en el promotor del gen.
2. Permitir que el promotor pueda renatularizarse una vez iniciada la transcripción.
3. Es un factor de transcripción que se une a las secuencias intensificadoras.
4. Fosforila un dominio especifico de la RNA polimerasa para que comience la transcripción.

Respuesta correcta: 4. Fosforila un dominio especifico de la RNA polimerasa para que comience la transcripción.